Nasal septal deviation on exam

The above is a clinical trial inclusion criterion. Annotated with entity spans:
[Condition: Nasal septal deviation] on exam